Clinical trial exclusion criterion:
5. Patients in Highly allergic constitution

Annotated entities:
- Condition: "Highly allergic constitution"